當法洛氏四重症（tetralogy of Fallot）病兒發生發紺發作（hypoxic spells, blue spells）時，心雜音會如何改變？
A. 變大聲
B. 不變
C. 變小聲
D. 會改變成舒張期雜音

正確答案：C. 變小聲